下列不孕症的原因，何者不需要使用人工協助生殖的治療？
A. 輸卵管阻塞
B. 不明原因不孕症
C. 男性因素嚴重的少精症
D. 子宮肌瘤

正確答案：D. 子宮肌瘤